Clinical trial exclusion criterion:
Anatomical limitations preventing placement of an electrode

Entity relations:
- Has_negation("placement of an electrode", "preventing")